Clinical trial inclusion criterion:
Subjects who have previously undergone LASIK surgery

Entity relations:
- Has_temporal("LASIK surgery", "previously")